Clinical trial inclusion criterion:
If a female of child-bearing potential, must have a negative pregnancy test.

Annotated entities:
- Person: "female"
- Condition: "child-bearing potential"
- Condition: "negative"
- Measurement: "pregnancy test"